Clinical trial exclusion criterion:
Other serious underlying medical conditions which could impair the ability of the patient to participate in the study

Annotated entities:
- Condition: "serious medical conditions"
- Observation: "ability of the patient to participate"